Clinical trial inclusion criterion:
TLC > 120% predicted, RV > 150% predicted.

Annotated entities:
- Measurement: "TLC"
- Value: "> 120% predicted"
- Measurement: "RV"
- Value: "> 150% predicted"